¿En cuál de las siguientes fases de la técnica de desensibilización y reprocesamiento por movimientos oculares (DRMO o EMDR) de Shapiro, para el tratamiento del estrés postraumático, el terapeuta realiza series de estimulación bilateral visual o táctil?:
1. Fase de Evaluación.
2. Fase de Desensibilización.
3. Fase de Exploración Corporal.
4. Fase de Clausura.

Respuesta correcta: 2. Fase de Desensibilización.